Clinical trial exclusion criterion:
Known renal failure or allergy to acetazolamide and other sulfonamides

Annotated entities:
- Condition: "renal failure"
- Condition: "allergy"
- Drug: "acetazolamide"
- Drug: "sulfonamides"